Clinical trial exclusion criterion:
Parkinson's disease with impulse Control disorder (ICD)

Annotated entities:
- Condition: "Parkinson's disease"
- Condition: "impulse Control disorder (ICD)"